Clinical trial exclusion criterion:
age > 80 years;

Entity relations:
- Has_value("age", "> 80 years")